Hypersensitivity to apomorphine or one of the excipients

The above is a clinical trial exclusion criterion. Annotated with entity spans:
[Condition: Hypersensitivity] to [Drug: apomorphine] or one of the [Drug: excipients]